No previous use of vitamin D.

The above is a clinical trial inclusion criterion. Annotated with entity spans:
[Negation: No] [Temporal: previous] use of [Value: vitamin D].